Hemoglobin <10 g/dL

The above is a clinical trial exclusion criterion. Annotated with entity spans:
[Measurement: Hemoglobin] [Value: <10 g/dL]